Clinical trial exclusion criterion:
Weight gain or loss > 5 kg in the last 3 months, ongoing weight-loss diet (hypocaloric diet) or use of weight loss agents.

Entity relations:
- Has_temporal("weight-loss diet", "ongoing")
- Subsumes("weight-loss diet", "hypocaloric diet")
- Has_value("Weight gain", "> 5 kg")
- Has_temporal("Weight gain", "in the last 3 months")
- OR("Weight gain", "Weight loss")
- OR("Weight gain", "weight loss agents", "weight-loss diet")